Psychiatric disease which difficults the adherence to the protocol, such as psychosis, obsessive-compulsive disorders, bipolar disease under treatment, diseases which require treatment with lithium and suicidal ideas in the last 5 years from the inclusion;

The above is a clinical trial exclusion criterion. Annotated with entity spans:
[Condition: Psychiatric disease] which [Qualifier: difficults the adherence to the protocol], such as [Condition: psychosis], [Condition: obsessive-compulsive disorders], [Condition: bipolar disease] [Qualifier: under treatment], [Condition: diseases which require treatment with lithium] and [Condition: suicidal ideas] [Temporal: in the last 5 years from the inclusion];